Clinical trial inclusion criterion:
Absence of oral lesions

Annotated entities:
- Negation: "Absence"
- Condition: "oral lesions"